signed informed consent form after reading the information about the study and talking with one of the investigators

The above is a clinical trial inclusion criterion. Annotated with entity spans:
[Informed_consent: signed informed consent form after reading the information about the study and talking with one of the investigators]